Clinical trial exclusion criterion:
Co-infection with hepatitis C virus, hepatitis D virus or human immunodeficiency virus (HIV)

Annotated entities:
- Qualifier: "hepatitis C virus"
- Qualifier: "hepatitis D virus"
- Qualifier: "human immunodeficiency virus"
- Qualifier: "HIV"
- Condition: "Co-infection"